下列何者是血液透析過程中最常見之急性併發症？
A. 高血壓
B. 低血壓
C. 抽筋
D. 嘔吐

正確答案：B. 低血壓